Clinical trial exclusion criterion:
Subject with symptomatic postural hypotension (severe dizziness or fainting

Entity relations:
- Has_qualifier("postural hypotension", "symptomatic")
- Has_qualifier("dizziness", "severe")
- Subsumes("postural hypotension", "dizziness")
- OR("dizziness", "fainting")